Clinical trial exclusion criterion:
Active substance or alcohol use or dependence that could interfere with participation

Annotated entities:
- Condition: "substance use or dependence"
- Condition: "alcohol use or dependence"
- Subjective_judgement: "that could interfere with participation"
- Non-query-able: "that could interfere with participation"